Receipt of immune globulins, blood or blood-derived products in the past 3 months

The above is a clinical trial exclusion criterion. Annotated with entity spans:
Receipt of [Drug: immune globulins], [Drug: blood] or [Drug: blood-derived products] [Temporal: in the past 3 months]